Clinical trial exclusion criterion:
Prior monoclonal antibody, radioimmunoconjugate, antibody drug conjugate, phototherapy, radiotherapy, chemotherapy, immunotherapy, immunosuppressive therapy, or any test agent within 3 weeks or for alemtuzumab 8 weeks of Day 1.

Annotated entities:
- Drug: "monoclonal antibody"
- Drug: "radioimmunoconjugate"
- Drug: "antibody drug conjugate"
- Procedure: "phototherapy"
- Procedure: "radiotherapy"
- Procedure: "chemotherapy"
- Procedure: "immunotherapy"
- Procedure: "immunosuppressive therapy"
- Temporal: "within 3 weeks of Day 1"
- Drug: "alemtuzumab"
- Temporal: "8 weeks of Day 1"
- Reference_point: "Day 1"